Clinical trial exclusion criterion:
Documented history of liver or kidney problems

Entity relations:
- Has_temporal("liver problems", "history")
- OR("liver problems", "kidney problems")